Clinical trial exclusion criterion:
Karnofsky Performance Status (KPS) < 60.

Annotated entities:
- Measurement: "Karnofsky Performance Status"
- Measurement: "KPS"
- Value: "< 60"